Clinical trial exclusion criteria:
Patients not capable or willing to provide informed consent
Patients starting Adalimumab less than five half-lives after the interruption of a previous anti-TNF therapy.

Annotated entities:
- Non-query-able: "Patients not capable or willing to provide informed consent"
- Drug: "Adalimumab"
- Temporal: "less than five half-lives after the interruption of a previous anti-TNF therapy"
- Reference_point: "the interruption of a previous anti-TNF therapy"
- Procedure: "anti-TNF therapy"
- Temporal: "previous"